一位 36 歲男性因腹痛入院，他從半年前開始就斷斷續續有下腹痛、腹瀉、噁心、嘔吐、發燒及體重減輕的現象。身體診查顯示：體溫：37.1°C，心跳：90/分，血壓：124/82 mmHg。抽血檢查： WBC：11,000/mm3（normal：4,000～10,000/mm3）；hemoglobin：10.8 g/dL（normal：14～16 g/dL）； C-reactive protein：3.24 mg/dL（normal：<0.5），大腸鏡檢查發現迴腸（ileum）有狹窄及硬化現象。 下列何者是最可能的診斷？
A. 克隆氏症（Crohn's disease）
B. 大腸癌
C. 潰瘍性腸炎（ulcerative colitis）
D. 阿米巴腸炎（amoebic colitis）

正確答案：A. 克隆氏症（Crohn's disease）